The patient has no major impairment of renal or hepatic function, as defined by the following laboratory parameters: total bilirubin <1.5 X ULN; AST, ALT<2.5X ULN (<5 X ULN if liver metastases are present)

The above is a clinical trial inclusion criterion. Annotated with entity spans:
The patient has [Negation: no] [Condition: major impairment of renal] or hepatic function, as defined by the following laboratory parameters: [Measurement: total bilirubin] [Value: <1.5 X ULN]; [Measurement: AST], [Measurement: ALT][Value: <2.5X ULN] ([Value: <5 X ULN] if [Condition: liver metastases] are present)